Clinical trial inclusion criterion:
Patients with surgical contraindication or reject to surgery.

Annotated entities:
- Condition: "contraindication"
- Procedure: "surgical"
- Observation: "reject"
- Procedure: "surgery"